Un hombre de 88 años viene a consulta porque se ha caído 3 veces en los últimos 6 meses. Ninguna de las caídas se acompañaba de “mareo” o síncope. Una caída ocurrió mientras caminaba por el jardín, en las otras tropezaba dentro de la casa. Sus antecedentes médicos incluyen hipertensión arterial sin cambios posturales en la presión arterial, gota, artrosis y depresión. Toma 5 medicinas regularmente. ¿Cuál de las siguientes es la que más probablemente contribuya a las caídas en este paciente?
1. Alopurinol.
2. Hidroclorotiazida.
3. Lisinopril.
4. Paroxetina.

Respuesta correcta: 4. Paroxetina.